3. Patients with other nervous system diseases(e.g., cerebral tumor, neurinoma, trigeminal neuralgia,etc)

The above is a clinical trial exclusion criterion. Annotated with entity spans:
3. Patients with other [Condition: nervous system diseases](e.g., [Condition: cerebral tumor], [Condition: neurinoma], [Condition: trigeminal neuralgia],etc)